Clinical trial inclusion criterion:
Normal renal and hepatic laboratory profiles

Annotated entities:
- Measurement: "hepatic laboratory profile"
- Value: "Normal"
- Measurement: "renal laboratory profile"